Clinical trial inclusion criterion:
No administration of diuretics and BCAA within the past 1 week

Annotated entities:
- Negation: "No"
- Drug: "diuretics"
- Drug: "BCAA"
- Temporal: "past 1 week"